當病人服用 warfarin 後，再併服下列何種藥物，將導致其抗血栓作用之降低？
A. Aspirin
B. Clopidogrel
C. Barbiturates
D. Heparin

正確答案：C. Barbiturates